橫結腸的特徵不包括下列何者？
A. 管狀腸腺（tubular intestinal glands）
B. 黏膜肌層（muscularis mucosae）
C. 結腸帶（taeniae coli）
D. 腸絨毛（villi）

正確答案：D. 腸絨毛（villi）